Sexually active patients must be willing to utilize one of the more effective birth control methods for 6 months after the CTL infusion. The male partner should use a condom.

The above is a clinical trial inclusion criterion. Annotated with entity spans:
[Pregnancy_considerations: Sexually active patients must be willing to utilize one of the more effective birth control methods for 6 months after the CTL infusion. The male partner should use a condom.]